El contador de partículas de Counter Coulter® utiliza una solución electrolítica de:
1. Cloruro de litio al 0,9% en agua.
2. Tiocianato amónico en solvente hidrófilo.
3. Cloruro de litio al 15% en solvente hidrófobo.
4. Cloruro de sodio al 0,9% en agua.
5. Cloruro de sodio al 0,9% en metanol.

Respuesta correcta: 4. Cloruro de sodio al 0,9% en agua.